Clinical trial exclusion criterion:
Cystolithiasis within the past 3 months

Annotated entities:
- Condition: "Cystolithiasis"
- Temporal: "within the past 3 months"